Clinical trial exclusion criterion:
4. Acute decompensated heart failure within 1 month of Screening.

Entity relations:
- Has_qualifier("heart failure", "decompensated")
- Has_qualifier("heart failure", "Acute")
- Has_index("within 1 month of Screening", "Screening")
- Has_temporal("heart failure", "within 1 month of Screening")